Clinical trial inclusion criterion:
Antiviral experienced,

Annotated entities:
- Drug: "Antiviral"
- Mood: "experienced"
- Observation: "experienced"